Clinical trial exclusion criterion:
Person has a history of chronic skin breakdown on the residual limb.

Entity relations:
- Has_qualifier("skin breakdown", "chronic")
- Has_qualifier("skin breakdown", "residual limb")